Clinical trial inclusion criterion:
retrospectively, with any significant change in motor function over at least one year, unrelated to relapse.

Entity relations:
- Has_qualifier("change in motor function", "significant")
- Has_qualifier("change in motor function", "unrelated to relapse")
- Has_temporal("change in motor function", "over at least one year")